Clinical trial inclusion criterion:
The patients underwent chemotherapy, radiation therapy or targeted therapy(herceptin) after surgery according to the 2013 NCCN guideline.

Entity relations:
- Subsumes("targeted therapy", "herceptin")
- Has_index("after surgery", "surgery")
- Has_temporal("chemotherapy", "after surgery")
- Has_qualifier("chemotherapy", "2013 NCCN guideline")
- OR("chemotherapy", "radiation therapy", "targeted therapy")